Clinical trial exclusion criterion:
Severe daytime sleepiness, defined as Epworth Sleepiness Scale score 18 or higher or a report of falling asleep driving during the previous year, and deemed a safety risk by study physician

Entity relations:
- Has_value("Epworth Sleepiness Scale", "score 18 or higher")